Positive urine drug screening test

The above is a clinical trial exclusion criterion. Annotated with entity spans:
[Value: Positive] [Measurement: urine drug screening test]